下列寄生蟲中，何者感染不會導致患者腦部病變？
A. 日本血吸蟲（Schistosoma japonicum）
B. 豬肉絛蟲（Taenia solium）
C. 單胞絛蟲（Echinococcus granulosus）
D. 棘口吸蟲（Echinostoma spp.）

正確答案：D. 棘口吸蟲（Echinostoma spp.）